Clinical trial inclusion criterion:
Planned total or near-total thyroidectomy

Annotated entities:
- Procedure: "thyroidectomy"
- Qualifier: "total"
- Qualifier: "near-total"